Clinical trial exclusion criterion:
The ulcer have been treated with growth factors in the last 8 weeks

Entity relations:
- Has_temporal("treated", "in the last 8 weeks")
- AND("ulcer", "treated")
- AND("treated", "growth factors")